How are looped genes identified in yest?

Gene-loop formation is dependent on regulatory proteins localized at the 5' and 3' ends of genes, such as TFIIB